Clinical trial exclusion criterion:
Patients receiving prednisone = 1mg/kg/d for the treatment of acute GVHD or mild, severe chronic GVHD.

Annotated entities:
- Drug: "prednisone"
- Value: "= 1mg/kg/d"
- Condition: "acute GVHD"
- Qualifier: "mild"
- Qualifier: "severe"
- Qualifier: "chronic"
- Condition: "GVHD"